Clinical trial inclusion criteria:
Patients after throat surgeries: tonsillectomy, adenotonsillectomy, uvulopalatoplasty, uvulopalatopharyngoplasty
Patients with acute throat diseases: pharyngitis, tonsillitis, pharyngotonsillitis

Annotated entities:
- Procedure: "throat surgeries"
- Procedure: "tonsillectomy"
- Procedure: "adenotonsillectomy"
- Procedure: "uvulopalatoplasty"
- Procedure: "uvulopalatopharyngoplasty"
- Condition: "acute throat diseases"
- Undefined_semantics: "acute throat diseases"
- Condition: "pharyngitis"
- Condition: "tonsillitis"
- Condition: "pharyngotonsillitis"